50 歲婦人，兩年前曾因乳癌而接受右側乳房切除，近日右側胸廓手術疤痕邊緣呈現多顆小腫瘤，下列何種處理最恰當？
A. Radiotherapy
B. Chemotherapy
C. 腫瘤切片檢查
D. 腫瘤超音波檢查

正確答案：C. 腫瘤切片檢查